闊筋膜張肌（tensor fasciae latae）退化萎縮，可能因下列何者受損而造成？
A. 臀上神經
B. 臀下神經
C. 閉孔神經
D. 坐骨神經

正確答案：A. 臀上神經